Clinical trial exclusion criterion:
evident intra-abdominal inflammation (diagnosed by imaging and/or laboratory results, including an abscess or cholecystitis)

Annotated entities:
- Condition: "intra-abdominal inflammation"
- Procedure: "imaging"
- Procedure: "laboratory"
- Condition: "abscess"
- Condition: "cholecystitis"